Clinical trial inclusion criterion:
Symptomatic patients with heart failure (men and women) aged >18 years,

Entity relations:
- Has_value("aged", ">18 years")
- OR("men", "women")